Clinical trial exclusion criterion:
Patients used to alcohol or drug (medication) abuse;

Entity relations:
- Subsumes("drug abuse", "medication abuse")
- OR("alcohol abuse", "medication abuse")